What tissue is most affected in Ehlers-Danlos syndromes?

the ehlers-danlos syndromes (eds) are a group of connective tissue disorders characterized by triad of joint hypermobility, skin extensibility, and tissue fragility.